Clinical trial inclusion criterion:
Fitzpatrick Skin phototype IV-VI, non-white race/ethnicity, including but not limited to - --African Americans, Asians, Pacific Islanders and Hispanics.

Annotated entities:
- Measurement: "Fitzpatrick Skin phototype"
- Value: "IV-VI"
- Person: "non-white race/ethnicity"
- Person: "African Americans"
- Person: "Asians"
- Person: "Pacific Islanders"
- Person: "Hispanics"